一位 22 歲女性洗腎已三年，兄弟姊妹欲捐一腎臟給她，下列那些 HLA 抗原具有較為重要的臨床意義？
A. A, B and C
B. A, B and DR
C. DP,DR and DQ
D. A, E and DQ

正確答案：B. A, B and DR